Less than 50 kg of weight

The above is a clinical trial exclusion criterion. Annotated with entity spans:
[Value: Less than 50 kg] of [Measurement: weight]